Clinical trial exclusion criterion:
known hypersensitivity or contraindication to the study drugs

Entity relations:
- AND("hypersensitivity", "study drugs")
- OR("hypersensitivity", "contraindication")